減緩糖尿病腎病變（diabetic nephropathy）腎衰竭之進行，最好的降血壓藥是那一種？
A. 利尿劑（diuretics）
B. α-交感神經阻斷劑（α-sympathetic blockers）
C. 血管張力素接受體阻斷劑（angiotensin receptor blockers）
D. 鈣離子管道阻斷劑（calcium channel blockers）

正確答案：C. 血管張力素接受體阻斷劑（angiotensin receptor blockers）